Clinical trial exclusion criteria:
type 1 diabetic or non-diabetic

Annotated entities:
- Condition: "type 1 diabetic"
- Condition: "non-diabetic"